Clinical trial inclusion criterion:
The attending clinician has equipoise regarding the duration of therapy

Annotated entities:
- Non-representable: "The attending clinician has equipoise regarding the duration of therapy"